足月正常新生兒純母乳哺餵，2 個月大時仍發現有黃疸，抽血檢查 bilirubin（direct/total）為 2.5/5.2 mg/dL，下列何者最正確？
A. 屬延遲性黃疸，是母乳哺餵嬰兒常有症狀，應注意嬰兒大便顏色，如果有點黃，追蹤即可
B. 是高間接性膽紅質血症（unconjugated hyperbilirubinemia）
C. 應立即停掉母奶哺餵，一般 3～5 天後黃疸會退，之後再母乳哺餵
D. 是膽汁滯留（cholestasis）；應進一步安排檢查

正確答案：D. 是膽汁滯留（cholestasis）；應進一步安排檢查